Clinical trial inclusion criterion:
Experience with pump-assisted infusions of IgPro20 at the tolerated flow rate of 25 mL/h per injection site for at least 1 month prior to Day 1.

Entity relations:
- Has_qualifier("IgPro20", "pump-assisted infusions")
- Has_qualifier("flow rate of 25 mL/h per injection site", "tolerated")
- Has_multiplier("IgPro20", "flow rate of 25 mL/h per injection site")
- Has_index("for at least 1 month prior to Day 1", "Day 1")
- Has_temporal("IgPro20", "for at least 1 month prior to Day 1")